Clinical trial exclusion criterion:
emergency operation

Annotated entities:
- Procedure: "operation"
- Qualifier: "emergency"